5. Written informed consent from patient or attending relative able to and willing to give informed consent. Consent form and information sheets will be translated into Malay and copies provided to the patient.

The above is a clinical trial inclusion criterion. Annotated with entity spans:
[Parsing_Error: 5.] [Non-query-able: Written informed consent from patient or attending relative able to and willing to give informed consent.] [Not_a_criteria: Consent form and information sheets will be translated into Malay and copies provided to the patient.]